A un paciente con arteriopatía oclusiva periférica que presenta claudicación intermitente, se le recomendará:
1. Reposo absoluto para disminuir las demandas de O2.
2. Elevar las piernas para reducir el dolor.
3. Aplicar calor seco en las piernas para favorecer la vasodilatación.
4. Caminar por superficies planas.
5. Usar medias de compresión gradual.

Respuesta correcta: 4. Caminar por superficies planas.